Estimated life expectancy = 6 months.

The above is a clinical trial inclusion criterion. Annotated with entity spans:
[Observation: Estimated life expectancy] [Value: = 6 months].